Clinical trial exclusion criterion:
Infection requiring systemic antibiotic therapy or other serious infection within 14 days before study enrollment.

Entity relations:
- Has_temporal("infection", "within 14 days before study enrollment")
- Has_qualifier("infection", "serious")
- Has_qualifier("infection", "other")
- AND("Infection", "systemic antibiotic therapy")
- OR("Infection", "infection")